ASA I-IV Age 55 or older Scheduled for operative repair of isolated intertrochanteric hip fracture

The above is a clinical trial inclusion criterion. Annotated with entity spans:
[Line: ASA I-IV] [Line: Age 55 or older] [Line: Scheduled for operative repair of isolated intertrochanteric hip fracture]